Use of Ace Inh and ARB for control of blood pressure who are willing to be placed on alternate drug(s) in the washout period for blood pressure control

The above is a clinical trial inclusion criterion. Annotated with entity spans:
Use of [Drug: Ace Inh] and [Drug: ARB] for [Procedure: control of blood pressure] who are [Informed_consent: willing to be placed on alternate drug(s) in the washout period for blood pressure control]